Clinical trial exclusion criterion:
psychic disorder (not including mild depression)

Annotated entities:
- Condition: "psychic disorder"
- Negation: "not"
- Condition: "mild depression"